La disociación del afecto se caracteriza por:
1. Ser un síntoma claro de enfermedad mental grave.
2. La coexistencia de emociones contrarias ante el mismo acontecimiento.
3. Sensación de desapego y ausencia de reactividad emocional.
4. Se produce en situaciones deprivación sensorial.

Respuesta correcta: 3. Sensación de desapego y ausencia de reactividad emocional.